Generalized brown hyperpigmentation是下列那一種內分泌疾病的皮膚表徵？
A. Cushing's syndrome
B. Addison's disease
C. Graves' disease
D. glucagonoma syndrome

正確答案：B. Addison's disease